Clinical trial exclusion criterion:
Patients may be excluded from the study for other reasons, at the investigator's discretion with detailed documentation.

Annotated entities:
- Non-query-able: "Patients may be excluded from the study for other reasons, at the investigator's discretion with detailed documentatio"